Clinical trial exclusion criterion:
Presence, or removal within the last 12 hours, of an epidural or spinal catheter, or recent (within the last 12 hours) epidural or spinal anesthesia/procedures

Annotated entities:
- Procedure: "removal of an epidural"
- Condition: "Presence of an epidural"
- Temporal: "within the last 12 hours"
- Condition: "Presence of a spinal catheter"
- Procedure: "removal of a spinal catheter"
- Temporal: "recent"
- Temporal: "within the last 12 hours"
- Procedure: "spinal anesthesia"
- Procedure: "epidural anesthesia"